Clinical trial inclusion criterion:
A concentration of LDL-cholesterol above 100 mg / dl, in the month prior to inclusion.

Annotated entities:
- Measurement: "LDL-cholesterol"
- Value: "above 100 mg / dl"
- Temporal: "in the month prior to inclusion"
- Reference_point: "inclusion"